Clinical trial exclusion criterion:
History or presence of hypersensitivity or idiosyncratic reaction to deferiprone or deferoxamine;

Annotated entities:
- Condition: "hypersensitivity"
- Condition: "idiosyncratic reaction"
- Drug: "deferiprone"
- Drug: "deferoxamine"